下列何處受損會導致病患出現動態顫抖（intention tremor）、動幅障礙（dysmetria）和姿勢不穩（unstable posture）等運動失調症狀？
A. 大腦運動皮質區
B. 小腦
C. 基底核
D. 中腦

正確答案：B. 小腦